Clinical trial exclusion criterion:
Body Mass Index (BMI) > 32

Entity relations:
- Has_value("Body Mass Index (BMI)", "> 32")